急性呼吸性鹼中毒常合併下列何種電解質向細胞內移動？① 鎂 ② 鉀 ③ 鈣 ④ 磷
A. ① ②
B. ② ④
C. ② ③ ④
D. ① ② ③ ④

正確答案：B. ② ④